Clinical trial exclusion criterion:
Allergy to methadone

Annotated entities:
- Condition: "Allergy"
- Drug: "methadone"